Children born outside the cluster, and returning more than 72 hours after the delivery

The above is a clinical trial inclusion criterion. Annotated with entity spans:
[Non-query-able: Children born outside the cluster, and returning more than 72 hours after the delivery]